Las heces de aspecto arcilloso son indicativas de un problema de:
1. Obstrucción de vías biliares.
2. Diarrea severa y prolongada.
3. Hemorragia gastrointestinal.
4. Ayuno prolongado.
5. Alimentación enteral.

Respuesta correcta: 1. Obstrucción de vías biliares.